ASA physical status I-III;

The above is a clinical trial inclusion criterion. Annotated with entity spans:
[Measurement: ASA physical status] [Value: I-III];